Clinical trial exclusion criterion:
Inability to complete 400 m walk within 15 minutes without sitting or interpersonal assistance, as an indicator of disablement and likely inability to fully engage in the exercise intervention

Annotated entities:
- Condition: "Inability to complete 400 m walk within 15 minutes without sitting"
- Condition: "interpersonal assistance Inability to complete 400 m walk within 15 minutes without"